Clinical trial exclusion criterion:
The above information is not intended to contain all considerations relevant to a patient's potential participation in a clinical trial.

Annotated entities:
- Not_a_criteria: "The above information is not intended to contain all considerations relevant to a patient's potential participation in a clinical trial."